Which receptor is modulated with Siponimod?

Siponimod is a functional sphingosine-1-phosphate (S1P) antagonist.